Clinical trial inclusion criterion:
Essential hypertension who had never received angiotensin II receptor antagonists and calcium channel blockers

Entity relations:
- Has_negation("angiotensin II receptor antagonists", "never")
- OR("angiotensin II receptor antagonists", "calcium channel blockers")